Clinical trial exclusion criterion:
Refusal

Annotated entities:
- Non-query-able: "Refusal"